Clinical trial exclusion criterion:
day 3 transfers

Annotated entities:
- Non-query-able: "day 3 transfers"